Clinical trial exclusion criterion:
Autoimmune, rheumatologic or inflammatory disease which are not psoriasis or psoriatic arthritis

Annotated entities:
- Condition: "disease Autoimmune"
- Condition: "inflammatory disease"
- Condition: "disease rheumatologic"
- Negation: "not"
- Condition: "psoriasis"
- Condition: "psoriatic arthritis"